若微循環動脈端之靜水壓為 35 mmHg，靜脈端之靜水壓為 15 mmHg，微血管滲透壓為 22 mmHg，組織間隙靜水壓為 1 mmHg，組織間隙滲透壓為 0 mmHg，則其再吸收壓（reabsorption pressure）為多少 mmHg？
A. 8
B. 10
C. 14
D. 22

正確答案：A. 8